45歲的張先生在中年失業經濟窘困之際，他的太太以家庭暴力之故訴請離婚成功，最令張先生憤恨的是離婚的太太瓜分了他的房產。這天，他因為失眠到你的門診拿藥，他除了抒發憤怒情緒外，還說要去燒了太太的房子。你判斷張先生採取傷害前妻行動之機會頗高，此時該如何處理？
A. 努力勸導，並清楚記載病歷
B. 通報社工並採取保護前妻之措施
C. 請張先生簽切結書聲明不會如此行動
D. 給予安眠及抗焦慮藥物

正確答案：B. 通報社工並採取保護前妻之措施